Clinical trial inclusion criterion:
Understands the study procedure, alternatives, and risks and voluntarily agrees to participate by giving written informed concent

Annotated entities:
- Post-eligibility: "Understands the study procedure, alternatives, and risks and voluntarily agrees to participate by giving written informed concent"